Clinical trial inclusion criterion:
Currently Homeless

Annotated entities:
- Person: "Homeless"